下列為較特殊的膀胱炎，在病理學上何者以大的泡沫巨噬細胞大量堆積及 Michaelis-Gutmann 小體為特徵？
A. 間質性膀胱炎（interstitial cystitis）
B. 囊性膀胱炎（cystitis cystica）
C. 腺體膀胱炎（cystitis glandularis）
D. 軟斑（malacoplakia）

正確答案：D. 軟斑（malacoplakia）